Clinical trial inclusion criterion:
Patient previously enrolled in this study

Annotated entities:
- Non-query-able: "Patient previously enrolled in this study"